Está bajo control del eje hipotálamo-hipofisario la secreción de:
1. Cortisol.
2. Insulina.
3. Calcitonina.
4. Glucagón.
5. Parathormona.

Respuesta correcta: 1. Cortisol.